Gestational age 27 0/7 to 36 6/7 weeks;

The above is a clinical trial inclusion criterion. Annotated with entity spans:
[Measurement: Gestational age] [Value: 27 0/7 to 36 6/7 weeks];